uncontrolled concomitant medical conditions that may compromise to chemotherapy

The above is a clinical trial inclusion criterion. Annotated with entity spans:
[Qualifier: uncontrolled] [Temporal: concomitant] [Condition: medical conditions that may compromise to chemotherapy]